What class of drugs is commonly associated with Drug-induced interstitial lung disease (DIILD)?

Cytotoxic drugs are the most common cause of toxic lung disease.